針對交通意外事故死亡者調查，從這些死亡者的左股動脈和左冠狀動脈各抽取血液樣本，以測量酒精濃度，總共抽取 25 個意外事故的死亡者。研究者的問題是「左股動脈的血液平均酒精濃度是否顯 著不同於左冠狀動脈的血液平均酒精濃度？」你將採用何種統計方法檢定上述資料？
A. 獨立 t 檢定
B. 卡方檢定
C. 配對 t 檢定
D. 麥內瑪檢定（McNemar's test）

正確答案：C. 配對 t 檢定